Clinical trial inclusion criteria:
Patients diagnosed at the out-patient cystoscopy with papillary bladder tumour will be legible for inclusion

Annotated entities:
- Visit: "out-patient"
- Procedure: "cystoscopy"
- Condition: "papillary bladder tumour"